Clinical trial exclusion criterion:
Active upper GI bleeding within 3 months (90 days) prior to procedure.

Entity relations:
- Has_temporal("upper GI bleeding", "Active")
- Has_index("within 3 months (90 days) prior to procedure", "procedure")